Clinical trial exclusion criterion:
Immunosuppressive therapy or renal dialysis (current or planned within the next 6 months).

Entity relations:
- Has_index("within the next 6 months", "the next 6 months")
- Has_mood("Immunosuppressive therapy", "current")
- Has_temporal("Immunosuppressive therapy", "within the next 6 months")
- OR("current", "planned")
- OR("Immunosuppressive therapy", "renal dialysis")